Age >12 months

The above is a clinical trial inclusion criterion. Annotated with entity spans:
[Person: Age] [Value: >12 months]